Clinical trial inclusion criterion:
Age between 18-50 years old,

Annotated entities:
- Person: "Age"
- Value: "between 18-50 years old"